Clinical trial exclusion criterion:
Cardiac troponin I ≥ 0.2 ng/mL within 28 days of randomization.

Entity relations:
- Has_value("Cardiac troponin I", "≥ 0.2 ng/mL")
- Has_index("within 28 days of randomization", "randomization")
- Has_temporal("Cardiac troponin I", "within 28 days of randomization")